Clinical trial exclusion criterion:
Presence (i.e., above the ULN) of anti-thyroid stimulating hormone receptor antibodies (anti-TSHR) and anti-thyroid peroxidase antibody (anti-TPO)

Entity relations:
- Subsumes("Presence", "above the ULN")
- Has_value("anti-thyroid stimulating hormone receptor antibodies (anti-TSHR)", "Presence")
- Has_value("anti-thyroid peroxidase antibody (anti-TPO)", "Presence")